Clinical trial exclusion criterion:
Patients are known to have impaired liver function, evidenced by ALT values within normal limits, and no previous liver disease.

Entity relations:
- Has_value("liver function", "impaired")
- Has_value("ALT values", "within normal limits")
- Has_temporal("liver disease", "previous")
- Has_negation("liver disease", "no")